Clinical trial exclusion criterion:
History of use of over 30mg oxycodone or equivalent per day

Entity relations:
- Has_multiplier("oxycodone", "over 30mg per day")
- OR("oxycodone", "oxycodone equivalent")